下列何種疾病與胰島素抗性（insulin resistance）的產生最無關？
A. 肥胖（obesity）
B. 庫欣氏症候群（Cushing's syndrome）
C. 腎上腺機能不全（adrenal insufficiency）
D. 肢端肥大症（acromegaly）

正確答案：C. 腎上腺機能不全（adrenal insufficiency）